Clinical trial inclusion criterion:
HIV-1 antibody negative

Entity relations:
- Has_value("HIV-1 antibody", "negative")